What is the function of R-spondin 1 and noggin in non-damaged gallbladders?

R-spondin 1 and noggin facilitate expansion of resident stem cells from non-damaged gallbladders.